上臂的肌皮神經（musculocutaneous nerve）受損時，下列何者最不可能因此而受到嚴重的影響？
A. 肱肌（brachialis）
B. 肱二頭肌（biceps brachii）
C. 喙肱肌（coracobrachalis）
D. 肱橈肌（brachioradialis）

正確答案：D. 肱橈肌（brachioradialis）